Clinical trial exclusion criterion:
Pericarditis

Annotated entities:
- Condition: "Pericarditis"